Diagnosed with GAD according to DSM-IV

The above is a clinical trial inclusion criterion. Annotated with entity spans:
Diagnosed with [Condition: GAD] according to [Measurement: DSM-IV]